What conditions are diagnosed using the scratch collapse test?

Scratch collapse test is used for the diagnosis of cts, cubital tunnel syndrome and carpal tunnel syndrome.